Has had a self-reported visual exam in the last two years

The above is a clinical trial inclusion criterion. Annotated with entity spans:
Has had a [Procedure: self-reported visual exam] [Temporal: in the last two years]